最近中線的小腦神經核為：
A. 球狀核（globose nucleus）
B. 頂核（fastigial nucleus）
C. 栓狀核（emboliform nucleus）
D. 齒狀核（dentate nucleus）

正確答案：B. 頂核（fastigial nucleus）